有關骨盆（pelvis）及骨盆骨折相關之敘述，下列何者正確？
A. 在坐姿時，上半身之重力主要由髖關節（hip joint）承受
B. 骨盆x-ray檢查中之pelvic outlet projection 對判斷半側骨盆（hemipelvis）內轉或外轉變化很有幫忙
C. 就受傷機轉及流行病學角度而言，骨盆骨折最常見的為外側壓迫性傷害（lateral compression）造成之骨折
D. 骨盆骨折，若恥骨聯合分離超過1公分，為手術治療之適應症

正確答案：C. 就受傷機轉及流行病學角度而言，骨盆骨折最常見的為外側壓迫性傷害（lateral compression）造成之骨折